En la alcaptonuria la enzima defectuosa puede ser la:
1. Dihidrobiopterina reductasa.
2. Tirosina aminotransferasa.
3. p-hidroxifenilpiruvato dioxigenasa.
4. Homogentisico 1,2-dioxigenasa.
5. Fumarilacetoacetasa.

Respuesta correcta: 4. Homogentisico 1,2-dioxigenasa.